腦部大池（cisterna magna）位在：
A. 大腦腳間窩（interpeduncular fossa）
B. 四疊體後方
C. 橋腦前方
D. 小腦與延腦後方交接處

正確答案：D. 小腦與延腦後方交接處